下述那一種物質可抑制泌乳素（prolactin）的分泌？
A. 多巴胺（dopamine）
B. 促甲狀腺素釋放激素（thyrotropin-releasing hormone）
C. 甲狀腺素（thyroxine）
D. 生長激素（growth hormone）

正確答案：A. 多巴胺（dopamine）